Clinical trial inclusion criterion:
Age = 18 years and NYHA (New York Heart Association) functional class II, III and IV

Annotated entities:
- Person: "Age"
- Value: "= 18 years"
- Measurement: "NYHA (New York Heart Association) functional class"
- Value: "II, III and IV"